Clinical trial exclusion criterion:
Serious chronic illness.

Entity relations:
- Has_qualifier("chronic illness", "Serious")